Clinical trial inclusion criterion:
Clinically diagnosed autoimmune encephalitis

Annotated entities:
- Qualifier: "Clinically diagnosed"
- Condition: "autoimmune encephalitis"